Clinical trial exclusion criterion:
Musculoskeletal disorders preventing the subject to perform physical training

Annotated entities:
- Condition: "Musculoskeletal disorders"
- Qualifier: "preventing the subject to perform physical training"